Clinical trial inclusion criterion:
recurrent severe hypoglycemic episodes or high glucose variability

Annotated entities:
- Multiplier: "recurrent"
- Qualifier: "severe"
- Condition: "hypoglycemic episodes"
- Condition: "high glucose variability"